下列何種藥物為 H+-K+ ATPase 之抑制劑？
A. Atropine
B. Cimetidine
C. Misoprostol
D. Omeprazole

正確答案：D. Omeprazole